復健醫學領域之功能評估，下列何者最不相關？
A. 病人生活上自我照顧之功能
B. 病患肝腎功能
C. 發病前行走能力
D. 軀幹與四肢之肌肉力量

正確答案：B. 病患肝腎功能